下列那一種藥物與 levodopa 併用時，要小心病人是否具有高血壓的病史？
A. amantadine
B. deprenyl
C. carbidopa
D. bromocriptine

正確答案：B. deprenyl